下列何者是胸腺嘧啶（thymine）在細胞內代謝分解之中間產物？
A. Uric acid
B. β-alanine
C. Carbamoyl phosphate
D. β-aminoisobutyrate

正確答案：D. β-aminoisobutyrate